¿Cuáles son, entre otros, los principales sesgos asociados al observador en el marco de las técnicas de observación?:
1. La duración del experimento.
2. El exceso de información.
3. La exactitud técnica.
4. La ilusión de aprendizaje.
5. La expectancia y los errores mecánicos de registro.

Respuesta correcta: 5. La expectancia y los errores mecánicos de registro.